Clinical trial exclusion criterion:
Prior endobronchial treatment for emphysema

Entity relations:
- causal("endobronchial treatment", "emphysema")
- Has_temporal("endobronchial treatment", "Prior")